What is the role of the Mcm2-Ctf4-Polα axis?

The Mcm2-Ctf4-Polα axis facilitates parental histone H3-H4 transfer to lagging strands.